Pregnancy: Women who are pregnant or lactating.

The above is a clinical trial exclusion criterion. Annotated with entity spans:
[Pregnancy_considerations: Pregnancy: Women who are pregnant or lactating.]